Clinical trial inclusion criterion:
Pulmonary lesion consistent with TB by radiological examination

Entity relations:
- multi("consistent with TB", "TB")
- Has_qualifier("Pulmonary lesion", "consistent with TB")
- AND("radiological examination", "Pulmonary lesion")